Clinical trial exclusion criterion:
8. History of Hepatitis B, C, or HIV

Annotated entities:
- Condition: "Hepatitis B"
- Condition: "Hepatitis C"
- Condition: "HIV"
- Temporal: "History"